Clinical trial exclusion criterion:
Subjects who are pregnant or nursing.

Annotated entities:
- Condition: "pregnant"
- Condition: "nursing"